有關結核病之敘述，下列何者錯誤？
A. 脊椎之結核病一般稱為波特氏病（Pott disease）
B. 在 N-RAMP1 基因某些多形性型之個人，結核病會自然消退，或直接獲得有效的免疫反應
C. 肺外結核最常見為淋巴結節炎（Lymphadenitis）
D. 對結核桿菌（Mycobacterium tuberculosis）之免疫反應主要是經由 Th1 細胞刺激巨噬細胞去吞噬細菌

正確答案：B. 在 N-RAMP1 基因某些多形性型之個人，結核病會自然消退，或直接獲得有效的免疫反應